Clinical trial exclusion criterion:
Mitral or aortic valve stenosis greater than mild (ie, aortic stenosis: jet >3.0 meters per second [m/s], mean gradient >25 millimeters of mercury [mmHg], and aortic valve area <1.5 centimeters squared [cm^2]; mitral stenosis: mean gradient >5 mmHg and mitral valve area <1.5 cm^2)

Annotated entities:
- Condition: "Mitral valve stenosis"
- Condition: "aortic valve stenosis"
- Qualifier: "greater than mild"
- Condition: "aortic stenosis"
- Measurement: "jet"
- Value: ">3.0 meters per second [m/s]"
- Measurement: "mean gradient"
- Value: ">25 millimeters of mercury [mmHg]"
- Measurement: "aortic valve area"
- Value: "<1.5 centimeters squared [cm^2]"
- Condition: "mitral stenosis"
- Measurement: "mean gradient"
- Value: ">5 mmHg"
- Measurement: "mitral valve area"
- Value: "<1.5 cm^2"